Clinical trial inclusion criterion:
naive to HCV treatment,

Annotated entities:
- Procedure: "HCV treatment"
- Negation: "naive"